Clinical trial exclusion criterion:
Current use of high dose inhaled or systemic steroids

Entity relations:
- Has_qualifier("steroids", "inhaled")
- Has_qualifier("steroids", "high dose")
- Has_temporal("steroids", "Current")
- OR("inhaled", "systemic")